A la hora de distinguir los pacientes alcohólicos con Síndrome de Korsakoff de los pacientes con demencia alcohólica podemos tener en cuenta que:
1. En los pacientes con Síndrome de Korsakoff la medida del cociente intelectual se mantiene relativamente intacta, mientras que esta medida se encuentra deteriorada en el caso de demencia alcohólica.
2. Los pacientes con demencia no presentan problemas de memoria, mientras que los que padecen el Síndrome de Korsakoff sí.
3. En los casos de demencia la amnesia aparece como el primer síntoma y el más relevante.
4. En el caso del Síndrome Korsakoff no existe amnesia anterógrada (capacidad para adquirir nueva información).
5. En el caso de la demencia las habilidades aprendidas permanecen intactas, mientras que en el Síndrome de Korsakoff se encuentran muy deterioradas.

Respuesta correcta: 1. En los pacientes con Síndrome de Korsakoff la medida del cociente intelectual se mantiene relativamente intacta, mientras que esta medida se encuentra deteriorada en el caso de demencia alcohólica.